長期服用下列何種藥物可能導致肝臟腺瘤（adenoma）？
A. 口服避孕藥
B. 類固醇
C. 甲醇
D. 乙醇

正確答案：A. 口服避孕藥